下列影響子宮頸癌治療預後的臨床病理因子中，何者較不重要？
A. 細胞角質化（keratinization）之程度
B. 腫瘤大小
C. 子宮頸旁組織（paracervical tissue）侵犯
D. 子宮頸被侵犯的深度

正確答案：A. 細胞角質化（keratinization）之程度